「梅斯納氏小體（Meissner's corpuscle）」具有下列何種特徵？
A. 分布於表皮
B. 分布於真皮的網狀層
C. 由淋巴細胞聚集形成的構造
D. 為觸覺接受器

正確答案：D. 為觸覺接受器